Clinical trial exclusion criterion:
Subjects with acute liver disease or active peptic ulcer disease.

Entity relations:
- Has_temporal("peptic ulcer disease", "active")
- AND("peptic ulcer disease", "acute liver disease")